當血中之鉀離子濃度上升時，體內那一個激素分泌增加？
A. 抗利尿激素（anti-diuretic hormone; ADH）
B. angiotensinogen
C. aldosterone
D. atrial natriuretic peptide（ANP）

正確答案：C. aldosterone